梅毒（syphilis）先使用 VDRL 檢測呈陽性，再使用 TPHA 測定亦呈陽性，才可以認定為陽性，稱為系列檢定（tests in series），其目的在於增加：
A. 敏感性（sensitivity）
B. 特異性（specificity）
C. 發生率（incidence）
D. 盛行率（prevalence）

正確答案：B. 特異性（specificity）